Prior enrolment in a BWATT program

The above is a clinical trial exclusion criterion. Annotated with entity spans:
[Non-representable: Prior enrolment in a BWATT program]